Clinical trial inclusion criterion:
Karnofsky/Lansky score 50 or greater

Annotated entities:
- Measurement: "Karnofsky/Lansky"
- Value: "score 50 or greater"